Clinical trial inclusion criterion:
ACT score <20 at randomization visit (visit 2).

Annotated entities:
- Measurement: "ACT score"
- Value: "<20"
- Temporal: "at randomization visit"